Clinical trial inclusion criterion:
Schirmer-1 test >5 mm after 5 min

Annotated entities:
- Measurement: "Schirmer-1 test"
- Value: ">5 mm"
- Temporal: "after 5 min"